Clinical trial inclusion criterion:
Women must be postmenopausal (i.e.12 months without menstrual period), or surgically sterile, i.e. women of child bearing potential are not allowed to be included into the study. In cases of doubt a pregnancy test should be performed. (NB -post menopausal women currently receiving hormone replacement are permissible)

Entity relations:
- AND("Women", "postmenopausal")
- Has_negation("menstrual period", "without")
- Has_temporal("menstrual period", "12 months")
- Subsumes("postmenopausal", "menstrual period")
- Has_negation("women", "not")
- AND("doubt", "pregnancy test")
- Has_negation("child bearing potential", "not")